Clinical trial exclusion criterion:
Newborns of substance abusing mothers.

Annotated entities:
- Person: "Newborns"
- Person: "mothers"
- Condition: "substance abusing"